Clinical trial inclusion criteria:
Adult patient (male or female) requiring emergency endotracheal intubation.

Annotated entities:
- Person: "Adult"
- Person: "male"
- Person: "female"
- Procedure: "emergency endotracheal intubation"